Fibro vascular proliferation lesions on the conjunctival and/or corneal surface (i.e.: pterygium)

The above is a clinical trial exclusion criterion. Annotated with entity spans:
[Condition: Fibro vascular proliferation lesions] on the [Qualifier: conjunctival] and/or [Qualifier: corneal surface] (i.e.: [Qualifier: pterygium])